Clinical trial exclusion criterion:
Current involvement in psychotherapy;

Annotated entities:
- Procedure: "psychotherapy"